Clinical trial exclusion criterion:
Estimated glomerular filtration rate (eGFR by MDRD) =20 mL/min per 1.73 m2 or serum creatinine >300 micromol/L (3.39 mg/dL) at screening.

Annotated entities:
- Measurement: "Estimated glomerular filtration rate"
- Measurement: "eGFR"
- Value: "=20 mL/min per 1.73 m2"
- Measurement: "serum creatinine"
- Value: ">300 micromol/L"
- Value: "3.39 mg/dL"